Clinical trial exclusion criterion:
Intake of medicines listed in the section 'Prohibited concomitant treatment' for 1 month prior to the enrollment in the trial.

Entity relations:
- Has_qualifier("medicines", "listed in the section 'Prohibited concomitant treatment'")
- Has_index("1 month prior to the enrollment in the trial", "the enrollment in the trial")
- Has_temporal("medicines", "1 month prior to the enrollment in the trial")